17 歲男性被診斷有左心心肌增厚，不正常的舒張灌注（diastolic filling）以及間歇性左心室外流阻塞 （intermittent outflow obstruction），此病人最可能的心臟病變是：
A. 類澱粉症（Amyloidosis）
B. 肥大性心肌症（Hypertrophic cardiomyopathy）
C. 擴張性心肌症（Dilated cardiomyopathy）
D. Loeffler 氏心肉膜心肌疾病（Loeffler's endomyocardial disease）

正確答案：B. 肥大性心肌症（Hypertrophic cardiomyopathy）